Clinical trial exclusion criterion:
Clinically significant laboratory abnormalities.

Entity relations:
- multi("laboratory abnormalities", "laboratory")
- Has_qualifier("laboratory abnormalities", "Clinically significant")